Chronic disease: renal, liver, cardiac, malignancy

The above is a clinical trial exclusion criterion. Annotated with entity spans:
[Condition: Chronic disease]: [Condition: renal], [Condition: liver], [Condition: cardiac], malignancy